non-reassuring fetal status

The above is a clinical trial exclusion criterion. Annotated with entity spans:
[Qualifier: non-reassuring] [Condition: fetal status]